Current use of CYP1A2 Inhibitors

The above is a clinical trial exclusion criterion. Annotated with entity spans:
Current use of [Drug: CYP1A2 Inhibitors]